capable of providing informed consent

The above is a clinical trial inclusion criterion. Annotated with entity spans:
[Informed_consent: capable of providing informed consent]